Clinical trial exclusion criterion:
History of deep vein thrombosis or pulmonary embolism or prostate cancer or heart failure (Class III and IV).

Annotated entities:
- Condition: "deep vein thrombosis"
- Condition: "pulmonary embolism"
- Condition: "prostate cancer"
- Condition: "heart failure"
- Qualifier: "Class III"
- Qualifier: "Class IV"